Clinical trial exclusion criterion:
amide and/or esther local anaesthetic allergy

Annotated entities:
- Drug: "amide local anaesthetic"
- Drug: "esther local anaesthetic"
- Condition: "allergy"